Clinical trial exclusion criterion:
A lower respiratory tract infection within 7 days of the screening visit.

Entity relations:
- Has_temporal("lower respiratory tract infection", "within 7 days of the screening visit")
- multi("within 7 days of the screening visit", "screening visit")